Clinical trial inclusion criterion:
Liver Transplant Recipients have been treated with twice-daily regimen of tacrolimus(TAC) plus everolimus(EVR) and TAC and EVR trough levels have stayed within targeted ranges for at least 6 weeks prior to enrollment

Entity relations:
- Has_multiplier("tacrolimus(TAC)", "twice-daily")
- Has_index("for at least 6 weeks prior to enrollment", "enrollment")
- Has_value("TAC trough levels", "within targeted ranges")
- Has_temporal("TAC trough levels", "for at least 6 weeks prior to enrollment")
- Has_multiplier("everolimus(EVR)", "twice-daily")
- Has_value("EVR trough levels", "within targeted ranges")
- Has_temporal("EVR trough levels", "for at least 6 weeks prior to enrollment")